Considered as a candidate for curative therapy

The above is a clinical trial exclusion criterion. Annotated with entity spans:
Considered as a candidate for [Procedure: curative therapy]